History of adverse effects from medications to be used in this study

The above is a clinical trial exclusion criterion. Annotated with entity spans:
[Non-representable: History of adverse effects from medications to be used in this study]